La Ley de Bases de la Sanidad Nacional de 1944 estableció con carácter obligatorio:
1. Que en cada provincia española se creara un Colegio de Auxiliares Sanitarios que integrara a practicantes, matronas y enfermeras.
2. La creación del Cuerpo de Ministrantes, Practicantes de Cirugía y Matronas.
3. El programa oficial que habían de seguir las enfermeras en las Facultades de Medicina.
4. La creación del Cuerpo de Enfermeras de Falange Española Tradicionalista y de las JONS.
5. Los requisitos para obtener el título y poder colegiarse como Enfermeras Profesionales de la Cruz Roja Española.

Respuesta correcta: 1. Que en cada provincia española se creara un Colegio de Auxiliares Sanitarios que integrara a practicantes, matronas y enfermeras.